acute illness at screening or randomization according to judgement by the investigator or patient

The above is a clinical trial exclusion criterion. Annotated with entity spans:
[Non-query-able: acute illness at screening or randomization according to judgement by the investigator or patient]